Patients with recent cerebral hemorrhage.

The above is a clinical trial exclusion criterion. Annotated with entity spans:
Patients with [Temporal: recent] [Condition: cerebral hemorrhage].